Clinical trial exclusion criterion:
eGFR <45

Annotated entities:
- Measurement: "eGFR"
- Value: "<45"